Clinical trial exclusion criterion:
6. Legal blindness or severe visual impairment;

Entity relations:
- OR("Legal blindness", "severe visual impairment")